Patients with underlying disease cases without the possibility of resuscitation (e.g., terminal cancer);

The above is a clinical trial exclusion criterion. Annotated with entity spans:
Patients with [Condition: underlying disease] cases [Qualifier: without the possibility of resuscitation] (e.g., [Condition: terminal cancer]);